Clinical trial exclusion criterion:
Enrolment in any activity requiring a blood donation greater than 50 mL during the period starting 30 days before the first study visit (Day -83, Day -60 or Day -30) or for the duration of the study period.

Annotated entities:
- Procedure: "blood donation"
- Non-representable: "Enrolment in any activity requiring a"
- Multiplier: "greater than 50 mL"
- Temporal: "during the period starting 30 days before the first study visit"
- Reference_point: "30 days before the first study visit"
- Temporal: "for the duration of the study period"
- Reference_point: "the study period"